Clinical trial inclusion criterion:
Physically and neurologically healthy [confirmed by a comprehensive medical history]

Annotated entities:
- Condition: "neurologically healthy"
- Condition: "healthy Physically"
- Procedure: "comprehensive medical history"